Clinical trial exclusion criterion:
Previous participation in this study

Annotated entities:
- Temporal: "Previous"
- Observation: "participation in this study"